下列那一項檢查對腹部鈍傷最具特異性（specificity）？
A. 腹部X光
B. 腹部超音波
C. 診斷性腹腔灌洗法
D. 腹部電腦斷層掃描

正確答案：D. 腹部電腦斷層掃描